Clinical trial exclusion criterion:
End stage chronic renal disease: Subjects will be excluded if on renal replacement therapy (hemodialysis or peritoneal).

Annotated entities:
- Condition: "End stage chronic renal disease"
- Procedure: "renal replacement therapy"
- Procedure: "hemodialysis"
- Qualifier: "peritoneal"